八歲大兒童，左腋下有區域性淋巴腺炎（regional lymphadenitis），有壓痛，已持續三週，二週之前左前臂還看見線性排列之紅斑，一個月前家中開始飼養貓，則下列何種疾病最可能？
A. Bartonella 桿菌感染
B. A 型鏈球菌（Group A Streptococcus）感染
C. 肺炎雙球菌（Streptococcus pneumoniae）感染
D. B 型流行性感冒嗜血桿菌（Hemophilus influenzae, type B）感染

正確答案：A. Bartonella 桿菌感染